Pedro es un adulto con una discapacidad reconocida del treinta y ocho por ciento debido a las limitaciones que le produce su problema crónico de salud mental. En las últimas consultas programadas refiere que prefiere estar solo, pues se siente inseguro cuando tiene relaciones con otras personas a las que ve “distintas”. Indique la etiqueta diagnostica de enfermería que representa la situación clínica de Pedro:
1. Aislamiento social.
2. Deterioro de la interacción social.
3. Afrontamiento inefectivo.
4. No se trata de un diagnóstico de enfermería.

Respuesta correcta: 2. Deterioro de la interacción social.